In which breast cancer patients can palbociclib be used?

Palbociclib is useful for women with hormone receptor-positive, human epidermal growth factor receptor 2-negative breast cancer.